散光鏡片度數的記載＋2.0D sphere with cylinder -3.0D axis 90°與下列何者是相當的？
A. -2.0D sphere with cylinder＋3.0D axis 180°
B. -2.0D sphere with cylinder -3.0D axis 90°
C. -1.0D sphere with cylinder＋3.0D axis 180°
D. -1.0D sphere with cylinder＋3.0D axis 90°

正確答案：C. -1.0D sphere with cylinder＋3.0D axis 180°